A history of intravitreal anti-VEGF injection of any type in the study eye within the last 45 days prior to study enrollment.

The above is a clinical trial exclusion criterion. Annotated with entity spans:
A [Temporal: history of] [Qualifier: intravitreal] [Procedure: anti-VEGF injection] of any type [Qualifier: in the study eye] [Temporal: within the last 45 days prior to study enrollment].